Clinical trial inclusion criterion:
At least one site of measurable disease on CT/MRI scans as defined by RECIST 1.1. Baseline imaging must be performed within 30 days of dosing.

Entity relations:
- AND("CT scans", "measurable disease")
- Has_temporal("imaging", "Baseline")
- Has_index("within 30 days of dosing", "dosing")
- Has_temporal("imaging", "within 30 days of dosing")
- OR("CT scans", "MRI scans")